Clinical trial exclusion criterion:
coagulopathies including platelet count of less than 100,000

Annotated entities:
- Condition: "coagulopathies"
- Measurement: "platelet count"
- Value: "less than 100,000"